Any contraindication to allergy testing will also result in exclusion

The above is a clinical trial exclusion criterion. Annotated with entity spans:
Any [Condition: contraindication] to [Procedure: allergy testing] will also result in exclusion